Aortic regurgitation mild or greater

The above is a clinical trial exclusion criterion. Annotated with entity spans:
[Condition: Aortic regurgitation] [Qualifier: mild or greater]